Having cancer or have received treatment for cancer within three years (persons with a history of cancer who are disease-free without treatment for three years or more are eligible), excluding minor skin cancers, which are allowed unless located at the vaccination site

The above is a clinical trial exclusion criterion. Annotated with entity spans:
Having [Condition: cancer] or have received [Procedure: treatment for cancer] [Temporal: within three years] (persons with a [Temporal: history] of [Condition: cancer] who are [Condition: disease-free] [Negation: without] [Procedure: treatment] [Temporal: for three years or more] [Grammar_Error: are eligible]), excluding minor skin cancers, which are allowed unless located at the vaccination site